Atrial fibrillation with a heart rate > 120/min.

The above is a clinical trial exclusion criterion. Annotated with entity spans:
[Condition: Atrial fibrillation] with a [Measurement: heart rate] [Value: > 120/min].